plans to receive care in the Community Health Center during the next year

The above is a clinical trial inclusion criterion. Annotated with entity spans:
[Mood: plans to] [Procedure: receive care] in the [Visit: Community Health Center] [Temporal: during the next year]